Clinical trial exclusion criterion:
Are using hormonal contraceptives, but are not on a stable dose of the same hormonal contraceptive product for at least 4 weeks before dosing and who do not agree to use the same contraceptive during the study and for 28 days after study drug discontinuation (Note: All female participants will be considered to be of childbearing potential unless they have been sterilized surgically [ie, bilateral tubal ligation, total hysterectomy, or bilateral oophorectomy, all with surgery at least 1 month before dosing]).

Annotated entities:
- Drug: "hormonal contraceptives"
- Negation: "not"
- Qualifier: "stable dose"
- Drug: "hormonal contraceptive"
- Temporal: "for at least 4 weeks before dosing"
- Drug: "contraceptive"
- Temporal: "during the study"
- Temporal: "for 28 days after study drug discontinuation"
- Reference_point: "study drug discontinuation"
- Observation: "do not agree"
- Qualifier: "the same"
- Qualifier: "the same"
- Non-representable: "(Note: All female participants will be considered to be of childbearing potential unless they have been sterilized surgically [ie, bilateral tubal ligation, total hysterectomy, or bilateral oophorectomy, all with surgery at least 1 month before dosing])"